El género Anisakis es un:
1. Tremátodo digenético.
2. Tremátodo monogenético.
3. Nemátodo.
4. Platelminto.
5. Artrópodo.

Respuesta correcta: 3. Nemátodo.